正常腦壓水腦症（normal pressure hydrocephalus）的病人至急診求診時，常見的臨床特徵中，下列何者不常出現？
A. 認知功能障礙
B. 尿失禁
C. 單側無力
D. 步態不穩

正確答案：C. 單側無力